Clinical trial exclusion criterion:
Known allergy or hypersensitivity reaction to dexmedetomidine

Annotated entities:
- Condition: "allergy"
- Condition: "hypersensitivity"
- Drug: "dexmedetomidine"